All patients who were wheelchair bound preoperatively

The above is a clinical trial exclusion criterion. Annotated with entity spans:
All patients who were [Observation: wheelchair bound] [Qualifier: preoperatively]